Major surgery, other than diagnostic surgery, within 2 weeks.

The above is a clinical trial exclusion criterion. Annotated with entity spans:
[Procedure: Major surgery], [Negation: other than] [Procedure: diagnostic surgery], [Temporal: within 2 weeks].